What is the mechanism of action of the biguanide class of diabetes drugs?

this biguanide is an oral insulin-sensitizing agent capable of increasing insulin sensitivity and decreasing plasma fasting insulin levels.